裘馨氏肌肉失養症（Duchenne muscular dystrophy）之女性帶因者（carrier），其臨床表現不包括下列何者？
A. 大部分無症狀
B. 80%帶因者血清中 creatine kinase 值會上升
C. 無症狀者其肌肉切片檢查為正常
D. 若同時為 Turner 症候群，則可能出現典型症狀

正確答案：C. 無症狀者其肌肉切片檢查為正常